下列分泌何種荷爾蒙的腦下垂體腺瘤（hormone-secreting pituitary adenoma），可以考慮服用多巴胺促效劑 （dopamine agonist）治療？
A. 促甲狀腺激素（thyroid-stimulating hormone, TSH）
B. 促腎上腺皮質激素（adrenocorticotropic hormone, ACTH）
C. 泌乳激素（prolactin）
D. 生長激素（growth hormone）

正確答案：C. 泌乳激素（prolactin）